有位研究者採用單因子變異數分析（one-way analysis of variance, ANOVA）比較肥胖、體重過重、正常體重和體重過輕者的低密度膽固醇數值是否有顯著不同，此研究者比較的是何種統計量（statistics）？
A. 平均值
B. 中位數
C. 眾數
D. 變異數

正確答案：A. 平均值